Absence of untreated caries.

The above is a clinical trial inclusion criterion. Annotated with entity spans:
[Negation: Absence] of [Qualifier: untreated] [Condition: caries].